下列關於受體酵素（receptor enzyme）的敘述何者正確？
A. 通常不是膜蛋白質
B. 對細胞質內的受質（substrate）具有酵素活性
C. 對細胞外的配體（ligand）具有酵素活性
D. 在細胞外具有受質（substrate）結合位

正確答案：B. 對細胞質內的受質（substrate）具有酵素活性